有關手部屈指肌腱斷裂之治療原則，下列何者錯誤？
A. 儘量於7天內進行肌腱縫合手術
B. 六週後幾乎不可能進行直接縫合手術
C. 若合併指動脈損傷，必須先做動脈吻合，然後再縫合肌腱
D. 病人術後之復健對功能恢復非常重要

正確答案：C. 若合併指動脈損傷，必須先做動脈吻合，然後再縫合肌腱